妊娠糖尿病篩檢在 24 至 28 週執行，50 公克葡萄糖喝後 1 小時血糖值多少（mg/dL）以上，須再做 公克葡萄糖耐力測驗（100 g oral glucose tolerance test）？
A. 110
B. 120
C. 130
D. 140

正確答案：D. 140